Clinical trial inclusion criterion:
Be willing to participate in a smoking cessation program

Entity relations:
- Has_mood("smoking cessation program", "willing to participate")